What does tsDMARD stand for?

tsDMARDs are targeted synthetic disease-modifying antirheumatic drugs.